Pregnant or breast feeding women

The above is a clinical trial exclusion criterion. Annotated with entity spans:
[Condition: Pregnant] or [Observation: breast feeding] [Person: women]